Clinical trial exclusion criteria:
Pulseless extremity
Compromised neurologic status on exam (specifically assessment of radial, ulnar, and median nerve)
Known allergy to local anesthetics (7) Not scheduled for closed reduction with percutaneous pinning under general anesthesia
Bleeding diathesis
American Society of Anesthesiologist (ASA) status 4 or higher.
Sleep apnea by polysomnography

Annotated entities:
- Condition: "Pulseless extremity"
- Condition: "Compromised neurologic status"
- Qualifier: "nerve radial"
- Qualifier: "nerve ulnar"
- Qualifier: "median nerve"
- Condition: "allergy"
- Drug: "local anesthetics"
- Negation: "Not"
- Mood: "scheduled for"
- Procedure: "closed reduction with percutaneous pinning"
- Procedure: "general anesthesia"
- Condition: "Bleeding diathesis"
- Measurement: "American Society of Anesthesiologist (ASA) status"
- Value: "4 or higher"
- Condition: "Sleep apnea"
- Procedure: "polysomnography"